Pregnancy or other Nicotine Replacement Therapy (NRT) contraindications

The above is a clinical trial exclusion criterion. Annotated with entity spans:
[Condition: Pregnancy] or other [Procedure: Nicotine Replacement Therapy] ([Procedure: NRT]) [Condition: contraindications]